Clinical trial exclusion criterion:
Diagnosed with a medical or psychiatric illness that may interfere with study participation

Entity relations:
- OR("psychiatric illness that may interfere with study participation", "illness that may interfere with study participation medical")